Unlikely to comply with the study requirements.

The above is a clinical trial exclusion criterion. Annotated with entity spans:
[Non-query-able: Unlikely to comply with the study requirements.]